Non-laboring

The above is a clinical trial inclusion criterion. Annotated with entity spans:
[Value: Non-laboring]